Clinical trial exclusion criterion:
Drug allergies to quinine sulfate or rosiglitazone

Entity relations:
- AND("allergies", "quinine sulfate")
- OR("quinine sulfate", "rosiglitazone")